Less than two months treatment of adjunctive medications AND less than one month on same dose: beta blockers, antidepressants, mood stabilizers, antianxiety medications.

The above is a clinical trial exclusion criterion. Annotated with entity spans:
[Multiplier: Less than two months] [Procedure: treatment] of [Drug: adjunctive medications] AND [Multiplier: less than one month] on [Multiplier: same dose]: [Drug: beta blockers], [Drug: antidepressants], [Drug: mood stabilizers], [Drug: antianxiety medications].